Clinical trial exclusion criterion:
Unable to attend scheduled visits (eg, lack of transportation) or lack of a caregiver or guardian to supervise study participation

Annotated entities:
- Mood: "Unable to attend scheduled visits"
- Observation: "lack of transportation"
- Observation: "lack of a caregiver"
- Observation: "lack of guardian"